are not willing to use a reliable method of barrier contraception during the study, or

The above is a clinical trial exclusion criterion. Annotated with entity spans:
[Pregnancy_considerations: are not willing to use a reliable method of barrier contraception during the study], or